Clinical trial inclusion criterion:
Age 18 years-65 years old

Annotated entities:
- Person: "Age"
- Value: "18 years-65 years old"